Una mujer de 25 años se presenta en el servicio de Urgencias por presentar en los últimos días equimosis y petequias en extremidades inferiores, así como gingivorragia. En el hemograma presenta los siguientes datos: Hb 13 g/dL, leucocitos 8.500/microL con fórmula leucocitaria normal y plaquetas 9.000/mm3. La determinación de los tiempos de coagulación es normal. ¿Cuál de las siguientes pruebas diagnósticas NO es preciso realizar?
1. Mutación JAK-2.
2. Aspirado de médula ósea.
3. Anticuerpos antinucleares.
4. Frotis de sangre periférica.

Respuesta correcta: 1. Mutación JAK-2.